Durante el siglo XIX, el movimiento reformista influyó considerablemente en el desarrollo de la enfermería española de esa época, siendo una de las figuras más relevantes:
1. Sara Barton.
2. Concepción Arenal.
3. María Teresa Junquera.
4. María de Madariaga.
5. María de Maeztu.

Respuesta correcta: 2. Concepción Arenal.